Clinical trial inclusion criterion:
Ability to understand and willingness to comply with the study protocol

Annotated entities:
- Non-query-able: "Ability to understand and willingness to comply with the study protocol"
- Post-eligibility: "Ability to understand and willingness to comply with the study protocol"